Creatinine clearance >30 milliliters/minute/1.73 centimeter squared

The above is a clinical trial inclusion criterion. Annotated with entity spans:
[Measurement: Creatinine clearance] [Value: >30 milliliters/minute/1.73 centimeter squared]